What percentage of C. elegans genes reside in operons?

Our evidence indicates that the genome contains at least 1,000 operons, 2 8 genes long, that contain about 15% of all C. elegans genes. Nearly 15% of the ~20,000 C. elegans genes are contained in operons, multigene clusters controlled by a single promoter.